Early Syphilis Cases Determined to Be Serofast at 6 Months after Initial Treatment

The above is a clinical trial inclusion criterion. Annotated with entity spans:
[Condition: Early Syphilis] Cases Determined to Be [Qualifier: Serofast] at [Temporal: 6 Months after Initial Treatment]